Clinical trial inclusion criterion:
Healthy male and/or female subjects between the ages of 18 and 55 years, and a body mass index (BMI) of ≥ 18 and ≤ 33 kg/m2 with body weight ≥ 50 and ≤ 90 kg at screening.

Annotated entities:
- Person: "male"
- Condition: "Healthy"
- Person: "female"
- Person: "ages"
- Value: "between 18 and 55 years"
- Measurement: "body mass index (BMI)"
- Value: "≥ 18 and ≤ 33 kg/m2"
- Measurement: "body weight"
- Value: "≥ 50 and ≤ 90 kg"
- Temporal: "at screening"
- Reference_point: "screening"